Clinical trial exclusion criterion:
7. Use of oral contraceptives in the preceding 2 weeks. Use of Depo-Provera® in the preceding 10 months.

Annotated entities:
- Parsing_Error: "7."
- Drug: "oral contraceptives"
- Temporal: "in the preceding 2 weeks"
- Drug: "Depo-Provera®"
- Temporal: "in the preceding 10 months"